Clinical trial exclusion criterion:
Long-term use of NSAIDs

Entity relations:
- Has_multiplier("NSAIDs", "Long-term use")